40 歲男性，已知是 B 型肝炎帶原者近 20 年，最近由於全身倦怠就醫。去年他曾因上消化道出血住院治療。身體檢查發現肝臟較小，實驗室檢查發現血中白蛋白值較低且凝血時間較長。下列何種身體檢查結果最不可能出現？
A. 蛇女頭（caput medusae）
B. 男性女乳症（gynecomastia）
C. 蜘蛛血管瘤（spider angioma）
D. 裂片形出血（splinter hemorrhage）

正確答案：D. 裂片形出血（splinter hemorrhage）